Clinical trial inclusion criterion:
Acute myocardial infarction < 12 h defined as:

Annotated entities:
- Condition: "Acute myocardial infarction"
- Temporal: "< 12 h"